Clinical trial inclusion criterion:
Singleton pregnancy;

Annotated entities:
- Condition: "Singleton pregnancy"